Able to adhere to the study protocol schedule, study restrictions and examination schedule

The above is a clinical trial inclusion criterion. Annotated with entity spans:
[Post-eligibility: Able to adhere to the study protocol schedule, study restrictions and examination schedule]